Evidence in the clinic history of relevant bilateral stenosis of renal artery (> 75%)

The above is a clinical trial exclusion criterion. Annotated with entity spans:
Evidence in the clinic history of [Qualifier: relevant] [Qualifier: bilateral] [Condition: stenosis of renal artery] ([Value: > 75%])